5'-ACCGTAAGGCTTTAG-3'DNA 之互補股（complementary strand），其核苷酸序列為何？
A. 5'-ACCGUAAGGCUUUA-3'
B. 5'-CUAAAGCCUUACGG-3'
C. 5'-CTAAAGCCTTACGGT-3'
D. 5'-ACCGTAAGGCTTTAG-3'

正確答案：C. 5'-CTAAAGCCTTACGGT-3'